Stroke, transient ischemic attack, acute coronary syndrome, or hospitalization for heart failure worsening, within the previous 30 days.

The above is a clinical trial exclusion criterion. Annotated with entity spans:
[Condition: Stroke], [Condition: transient ischemic attack], [Condition: acute coronary syndrome], or [Procedure: hospitalization] for [Condition: heart failure] [Qualifier: worsening], [Temporal: within the previous 30 days].